Clinical trial inclusion criteria:
Healthy pregnant women age 18 to 50
Singleton pregnancy at gestational age 36 weeks or more
Able to read and understand Norwegian.

Annotated entities:
- Condition: "Healthy"
- Condition: "pregnant"
- Person: "women"
- Person: "age"
- Value: "18 to 50"
- Condition: "Singleton pregnancy"
- Measurement: "gestational age"
- Value: "36 weeks or more"
- Observation: "Able to read and understand Norwegian"